Habitual dietary sodium intake > 3400mg per day

The above is a clinical trial inclusion criterion. Annotated with entity spans:
Habitual [Measurement: dietary sodium intake] [Value: > 3400mg per day]